Current DSM-IV diagnosis of cannabis dependence, >1 week detoxified and abstinent;

The above is a clinical trial inclusion criterion. Annotated with entity spans:
Current [Qualifier: DSM-IV] diagnosis of [Condition: cannabis dependence], [Multiplier: >1 week] [Condition: detoxified] and [Condition: abstinent];